成人感染了 A 型肝炎病毒，其潛伏期（incubation period）約為多少週？
A. 1 至 2
B. 2 至 6
C. 6 至 10
D. 10 至 16

正確答案：B. 2 至 6